La técnica denominada “Fumar señalizado”, es un tratamiento para el control del consumo de cigarrillos que está basado en:
1. Un procedimiento de autocontrol.
2. Las terapias de tercera generación.
3. Las técnicas aversivas.
4. La hipnosis.
5. Estrategias de mindfulness.

Respuesta correcta: 1. Un procedimiento de autocontrol.